Aspartate transaminase (AST) less than or equal to 5 x ULN

The above is a clinical trial inclusion criterion. Annotated with entity spans:
[Measurement: Aspartate transaminase (AST)] [Value: less than or equal to 5 x ULN]